Genotype 2, 3, 5 or 6 infection.

The above is a clinical trial exclusion criterion. Annotated with entity spans:
[Measurement: Genotype] [Value: 2, 3, 5 or 6] [Condition: infection].